prematurity (<37 weeks)/low birthweight <2500 g

The above is a clinical trial exclusion criterion. Annotated with entity spans:
[Condition: prematurity] (<37 weeks)/[Condition: low birthweight] [Value: <2500 g]